Clinical trial inclusion criterion:
Smoking history > 10 packs/year

Annotated entities:
- Measurement: "Smoking history"
- Value: "> 10 packs/year"